What is BORSA?

Borderline oxacillin-resistant Staphylococcus aureus is also known as (BORSA)